No contraindication to use of progesterone or combined oral contraceptive pills

The above is a clinical trial inclusion criterion. Annotated with entity spans:
[Negation: No] [Condition: contraindication] to use of [Drug: progesterone] or [Drug: combined oral contraceptive pills]